有關hereditary hemorrhagic telangiectasia的治療方式，下列何者不恰當？
A. regular nasal mucosal care with nasal saline
B. endonasal lasering or bipolar diathermy
C. septodermoplasty
D. vascular embolization

正確答案：D. vascular embolization